Subjects currently taking medications that affect heart rate and rhythm (i.e. Ca++ channel blockers, nitrates, alpha- or beta-blockers).

The above is a clinical trial exclusion criterion. Annotated with entity spans:
Subjects currently taking [Drug: medications] [Qualifier: that affect heart rate] and rhythm (i.e. [Drug: Ca++ channel blockers], [Drug: nitrates], [Drug: alpha-] or [Drug: beta-blockers]).